Clinical trial inclusion criterion:
Males or females aged >/= 50 years

Entity relations:
- Has_value("aged", ">/= 50 years")
- OR("Males", "females")